Clinical trial exclusion criterion:
Uncontrolled ascites or hepatic encephalopathy

Annotated entities:
- Condition: "ascites"
- Condition: "hepatic encephalopathy"
- Qualifier: "Uncontrolled"